5. Are unable to walk.

The above is a clinical trial exclusion criterion. Annotated with entity spans:
5. Are [Condition: unable to walk].